對於正常女性尿動力學檢查數值，下列何者錯誤？
A. 殘	尿量（residual urine）< 50 mL
B. 初感尿意（first desire to void）發生介於150 and 250 mL灌注液量
C. 強烈尿意（strong desire to void）發生在小於250 mL灌注液量
D. 膀胱容量（cystometric capacity）介於400 and 600 mL灌注液量

正確答案：C. 強烈尿意（strong desire to void）發生在小於250 mL灌注液量